Clinical trial exclusion criteria:
Uncontrolled medical problems including pulmonary, cardiovascular or orthopedic disease
Any debilitating disease prior to the SCI that caused exercise intolerance
Premorbid, ongoing major depression or psychosis, altered cognitive status
History of head injury or stroke
Metal plate in skull
History of seizures
Receiving drugs acting primarily on the central nervous system, which lower the seizure threshold (see appendix 2)
Pregnant females
Ongoing cord compression or a syrinx in the spinal cord or who suffer from a spinal cord disease such as spinal stenosis, spina bifida, MS, or herniated disk
Individuals with scalp shrapnel, cochlear implants, or aneurysm clips.

Annotated entities:
- Qualifier: "Uncontrolled"
- Condition: "medical problems"
- Condition: "pulmonary disease"
- Condition: "cardiovascular disease"
- Condition: "orthopedic disease"
- Condition: "exercise intolerance"
- Condition: "debilitating disease"
- Temporal: "prior to the SCI"
- Reference_point: "the SCI"
- Qualifier: "Premorbid"
- Temporal: "ongoing"
- Condition: "major depression"
- Condition: "psychosis"
- Condition: "altered cognitive status"
- Condition: "head injury"
- Condition: "stroke"
- Temporal: "History"
- Device: "Metal plate in skull"
- Condition: "seizures"
- Temporal: "History"
- Drug: "drugs acting primarily on the central nervous system"
- Qualifier: "lower the seizure threshold"
- Condition: "Pregnant"
- Person: "females"
- Condition: "cord compression"
- Condition: "syrinx"
- Qualifier: "spinal cord"
- Condition: "spinal stenosis"
- Condition: "spinal cord disease"
- Condition: "spina bifida"
- Condition: "MS"
- Condition: "herniated disk"
- Device: "scalp shrapnel"
- Device: "cochlear implants"
- Device: "aneurysm clips"